下列有關肺部血流疾病之敘述，何者正確？
A. 肺部大血管內產生血塊大部分是血栓形成（thrombosis）
B. 肺部栓塞（embolism）的栓子（embolus）主要來自腿部靜脈
C. 肺動脈栓塞可引起左心急性衰竭，造成病人死亡
D. 大部分的肺部栓塞可引起肺梗塞（infarct）

正確答案：B. 肺部栓塞（embolism）的栓子（embolus）主要來自腿部靜脈